Treated with either diet alone, any combination of oral antidiabetic agents, non-insulin injectables or insulin therapy

The above is a clinical trial inclusion criterion. Annotated with entity spans:
Treated with either [Procedure: diet] alone, any combination of [Drug: oral antidiabetic agents], [Drug: non-insulin injectables] or [Drug: insulin] therapy